Clinical trial inclusion criterion:
Person is currently fitted with a prosthesis using a non-microprocessor controlled prosthetic knee for at least 6 months.

Annotated entities:
- Device: "prosthesis"
- Device: "prosthetic knee"
- Qualifier: "non-microprocessor controlled"
- Temporal: "at least 6 months"